腦部血流約占心輸出量（cardiac output）的多少百分比？
A. 6%
B. 15%
C. 25%
D. 30%

正確答案：B. 15%